Clinical trial inclusion criterion:
Non-reversible airway obstruction (post-bronchodilator FEV1/FVC < 0.7 and FEV1 < 80 %)

Annotated entities:
- Condition: "airway obstruction"
- Qualifier: "Non-reversible"
- Measurement: "FEV1/FVC"
- Qualifier: "post-bronchodilator"
- Value: "< 0.7"
- Measurement: "FEV1"
- Value: "< 80 %"